Clinical trial exclusion criterion:
Those less than 18 years of age.

Annotated entities:
- Value: "less than 18 years"
- Person: "age"